Clinical trial exclusion criterion:
Have an Axis I diagnosis of Schizophrenia, Schizoaffective Disorder, Schizophreniform Disorder or Bipolar I Disorder as diagnosed by the Structured Clinical Interview for DSM-IV Axis I Disorders (SCID-I), and pertinent subsequent for ruling out exclusionary diagnoses.

Entity relations:
- AND("Structured Clinical Interview for DSM-IV Axis I Disorders (SCID-I)", "Schizophrenia")
- OR("Schizophrenia", "Schizoaffective Disorder", "Schizophreniform Disorder", "Bipolar I Disorder")